Clinical trial inclusion criterion:
SVD defined on echocardiography by an alteration of bioprosthesis leaflets function with a mean transvalvular gradient > 20 mmHg and maximal velocity = 3 m/s and effective orifice area =1.2 cm², and/or an aortic regurgitation more or equal to grade 2 on 4.

Annotated entities:
- Condition: "SVD"
- Procedure: "echocardiography"
- Condition: "alteration of bioprosthesis leaflets function"
- Measurement: "mean transvalvular gradient"
- Value: "> 20 mmHg"
- Measurement: "maximal velocity"
- Value: "= 3 m/s"
- Measurement: "effective orifice area"
- Value: "=1.2 cm²"
- Condition: "aortic regurgitation"
- Value: "more or equal to 2 on 4"
- Measurement: "grade"